Known hypersensitivity to Ferinject®.

The above is a clinical trial exclusion criterion. Annotated with entity spans:
Known [Condition: hypersensitivity] to [Drug: Ferinject®].